Clinical trial exclusion criterion:
The use of magnesium in any dose that is prescribed for the purpose of HA prevention or treatment must be stable for at least 4 weeks. The incidental use of magnesium in multi-vitamins, laxatives, etc. is permissible but must be documented.

Annotated entities:
- Non-representable: "The use of magnesium in any dose that is prescribed for the purpose of HA prevention or treatment must be stable for at least 4 weeks. The incidental use of magnesium in multi-vitamins, laxatives, etc. is permissible but must be documented."